Previous bypass surgery or stenting of the superficial femoral artery

The above is a clinical trial exclusion criterion. Annotated with entity spans:
[Temporal: Previous] [Procedure: bypass surgery] or [Device: stenting of the superficial femoral artery]